Inborn errors of amino acid metabolism

The above is a clinical trial exclusion criterion. Annotated with entity spans:
[Condition: Inborn errors of amino acid metabolism]